關於 HLA-B27 與僵直性脊椎炎之相關敘述，那一項正確？
A. 診斷僵直性脊椎炎，做 HLA-B27 之檢查是必要的
B. 約 7 成左右的僵直性脊椎炎病人其 HLA-B27 是陽性的
C. HLA-B27 陽性的病人約 4 成左右日後會罹患僵直性脊椎炎
D. 一般而言，女性較少罹患僵直性脊椎炎；且預後較男性病人好，較少嚴重駝背

正確答案：D. 一般而言，女性較少罹患僵直性脊椎炎；且預後較男性病人好，較少嚴重駝背